下列何種肌肉失養症（muscular dystrophy）為性聯隱性遺傳（X-linked recessive）?
A. Duchenne muscular dystrophy
B. limb-girdle muscular dystrophy type 1A
C. facioscapulohumeral dystrophy
D. myotonic dystrophy

正確答案：A. Duchenne muscular dystrophy